Absolute neutrophil count ≥ 1,000/mcL

The above is a clinical trial inclusion criterion. Annotated with entity spans:
[Measurement: Absolute neutrophil count] [Value: ≥ 1,000/mcL]